What are the years of the initiation and completion of the Human Genome project?

The Human Genome Project (HGP) was initiated in 1990, and the completion of the genome project was in 2003.